Clinical trial exclusion criteria:
ileus
known or suspected bowel obstruction
active bowel inflammation
pregnancy
any presence of serious medical conditions ( esp. cardiac, renal, liver diseases)
history of prior colonic or rectal surgery
inability to obtain valid data from

Annotated entities:
- Condition: "ileus"
- Mood: "known"
- Mood: "suspected"
- Condition: "bowel obstruction"
- Temporal: "active"
- Condition: "bowel inflammation"
- Condition: "pregnancy"
- Condition: "serious medical conditions"
- Condition: "cardiac diseases"
- Condition: "liver diseases"
- Condition: "renal diseases"
- Temporal: "history of"
- Temporal: "prior"
- Procedure: "colonic surgery"
- Procedure: "rectal surgery"
- Non-query-able: "inability to obtain valid data from"